After the investigator has taken the decision to use human insulin or insulin analogues to treat the subject, any type 2 diabetic previously inadequately controlled with two or more OADs is eligible for the study

The above is a clinical trial inclusion criterion. Annotated with entity spans:
[Non-representable: After the investigator has taken the decision to use human insulin or insulin analogues to treat the subject], any [Condition: type 2 diabetic] [Temporal: previously] [Qualifier: inadequately controlled] with [Multiplier: two or more] [Condition: OADs] is eligible for the study